脊椎損傷病人中，容易出現呼吸衰竭的是那幾節？
A. 第三至第五頸椎
B. 第六至第七頸椎
C. 第三至第七胸椎
D. 第四至第五腰椎

正確答案：A. 第三至第五頸椎